How rare are CTCs (circulating tumour cells) in the plasma of patients?

However, largely because of the extremely low number of CTCs (as low as 1 in 10(9) hematologic cells) in the blood of patients, effective detection and separation of the rare cells remain a tremendous challenge.